Clinical trial exclusion criterion:
Patients with pre-treatment with steroid injections/or local anesthetics.

Annotated entities:
- Procedure: "steroid injections"
- Procedure: "local anesthetics"